Clinical trial inclusion criterion:
able to walk independently for 30 metres with or without an assistive device.

Annotated entities:
- Condition: "able to walk independently with or without an assistive device"
- Multiplier: "for 30 metres"